以電子顯微鏡觀察細胞膜（plasma membrane）結構，下列敘述何者錯誤？
A. 具三層構造特徵，內外兩層緻密層（electron dense layers）夾雜著透明層（electron lucent layer）
B. 內外兩層（electron layers）代表磷脂質親水性的一端
C. 中間透明層（electron lucent layer）代表厭水性分子
D. 細胞膜內側面具醣外被（glycocalyx）

正確答案：D. 細胞膜內側面具醣外被（glycocalyx）